Clinical trial exclusion criterion:
Has had major psychiatric illness and/or substance abuse problems during the past 12 months (including hospitalization or periods of work disability) that in the opinion of the investigator would preclude participation

Annotated entities:
- Condition: "psychiatric illness"
- Qualifier: "major"
- Undefined_semantics: "major"
- Condition: "substance abuse"
- Temporal: "during the past 12 months"
- Procedure: "hospitalization"
- Condition: "work disability"
- Subjective_judgement: "in the opinion of the investigator"
- Context_Error: "preclude participation"